關於梅毒（syphilis），下列敘述何者正確？
A. doxycycline 是目前認為治療首選的藥物
B. VDRL（Venereal disease research laboratory test）陽性即可診斷此病
C. 一般 Gram's stain 下可清楚看見菌體
D. 第二期梅毒可以侵犯皮膚、腎、肝、脾臟、肌肉骨骼等

正確答案：D. 第二期梅毒可以侵犯皮膚、腎、肝、脾臟、肌肉骨骼等